Clinical trial exclusion criterion:
Pregnant woman whose amniocentesis reveals any genetic abnormality

Entity relations:
- Has_value("amniocentesis", "genetic abnormality")